Informed consent given

The above is a clinical trial inclusion criterion. Annotated with entity spans:
[Informed_consent: Informed consent given]